克雷諾夫片段（Klenow fragment）是指：
A. 去掉 5'→3'外切核酸活性之 DNA 複製 I
B. 去掉 3'→5'外切核酸活性之 DNA 複製 I
C. 去掉 5'→3'外切核酸活性之 DNA 複製Ⅲ
D. 去掉 3'→5'外切核酸活性之 DNA 複製Ⅲ

正確答案：A. 去掉 5'→3'外切核酸活性之 DNA 複製 I